下列降血壓藥物中，何者會減少 bradykinin 和 substance P 的破壞，因而易引起乾咳的副作用？
A. lisinopril
B. amlodipine
C. diazoxide
D. clonidine

正確答案：A. lisinopril